結節性硬化症（tuberous sclerosis）的診斷依據，不包括下列何者？
A. cardiac rhabdomyoma
B. renal angiomyolipomas
C. pulmonary lymphangioleiomyomatosis
D. meningioma

正確答案：D. meningioma